Healthy male and/or female subjects between the ages of 18 and 55 years, and a body mass index (BMI) of ≥ 18 and ≤ 33 kg/m2 with body weight ≥ 50 and ≤ 90 kg at screening.

The above is a clinical trial inclusion criterion. Annotated with entity spans:
[Condition: Healthy] [Person: male] and/or [Person: female] subjects [Value: between] the [Person: ages] of 18 and 55 years, and a [Measurement: body mass index (BMI)] of [Value: ≥ 18 and ≤ 33 kg/m2] with [Measurement: body weight] [Value: ≥ 50 and ≤ 90 kg] [Temporal: at screening].